Subject is 65 years or older on the day of surgery

The above is a clinical trial inclusion criterion. Annotated with entity spans:
Subject is [Value: 65 years or older] [Temporal: on the day of surgery]